Clinical trial exclusion criterion:
Heart failure, New York Heart Association(NYHA) III/IV or eject fraction(EF)<40%;

Entity relations:
- Has_value("New York Heart Association(NYHA)", "III/IV")
- Has_value("eject fraction(EF)", "<40%")
- OR("Heart failure", "New York Heart Association(NYHA)", "eject fraction(EF)")